Patients with significant bleeding disorder or liver disorder

The above is a clinical trial exclusion criterion. Annotated with entity spans:
Patients with [Qualifier: significant] [Condition: bleeding disorder] or [Condition: liver disorder]